Clinical trial exclusion criterion:
Drug addiction, alcohol use in the amount over 2 units of alcohol a day, mental diseases.

Entity relations:
- Has_value("alcohol use", "over 2 units of alcohol a day")
- OR("Drug addiction", "alcohol use", "mental diseases")